Clinical trial inclusion criterion:
2. Patient is scheduled for a non-emergency procedure.

Entity relations:
- multi("non-emergency procedure", "non-emergency")
- Has_mood("non-emergency procedure", "scheduled")